Clinical trial exclusion criterion:
Pregnancy (urine pregnancy tests on the day of scans for menstruating girls).

Entity relations:
- Has_temporal("urine pregnancy tests", "on the day of scans")
- AND("menstruating girls", "urine pregnancy tests")